8. Pregnant or nursing females.

The above is a clinical trial exclusion criterion. Annotated with entity spans:
8. [Condition: Pregnant] or [Condition: nursing] [Person: females].